8. No history of drug allergy

The above is a clinical trial inclusion criterion. Annotated with entity spans:
8. [Negation: No] history of [Drug: drug] [Condition: allergy]